Clinical trial exclusion criterion:
9. Any of the following within the 12 months prior to study drug administration: myocardial infarction, severe/unstable angina, coronary/peripheral artery bypass graft, symptomatic congestive heart failure, cerebrovascular accident or transient ischemic attack, pulmonary embolism, deep vein thrombosis, or other thromboembolic event.

Annotated entities:
- Parsing_Error: "9."
- Temporal: "within the 12 months prior to study drug administration"
- Reference_point: "study drug administration"
- Condition: "myocardial infarction"
- Condition: "unstable angina"
- Condition: "severe angina"
- Condition: "coronary artery bypass graft"
- Condition: "peripheral artery bypass graft"
- Condition: "symptomatic congestive heart failure"
- Condition: "cerebrovascular accident"
- Condition: "transient ischemic attack"
- Condition: "pulmonary embolism"
- Condition: "deep vein thrombosis"
- Condition: "other thromboembolic event"